Clinical trial exclusion criterion:
Symptomatic coronary artery disease deemed to be significant by study physician at the time of screening

Annotated entities:
- Condition: "coronary artery disease"
- Qualifier: "Symptomatic"
- Temporal: "at the time of screening"
- Reference_point: "time of screening"